History of post-abortion complication or infection

The above is a clinical trial exclusion criterion. Annotated with entity spans:
[Temporal: History] of [Condition: post-abortion complication] or infection